Clinical trial inclusion criterion:
Life expectancy greater than or equal to 6 months

Entity relations:
- Has_value("Life expectancy", "greater than 6 months")
- OR("greater than 6 months", "equal to 6 months")